Clinical trial exclusion criterion:
Helicobacter infected patients who have not been treated for eradication (recruitment if negative in re-examination after treatment).

Annotated entities:
- Condition: "Helicobacter infected"
- Negation: "not"
- Procedure: "treated for eradication"